Clinical trial exclusion criterion:
History of symptomatic congestive heart failure, or ventricular arrhythmia requiring treatment.

Annotated entities:
- Condition: "congestive heart failure"
- Qualifier: "symptomatic"
- Condition: "ventricular arrhythmia"
- Qualifier: "requiring treatment"
- Procedure: "treatment"